Cicatricial meibomian gland dysfunction

The above is a clinical trial exclusion criterion. Annotated with entity spans:
[Qualifier: Cicatricial] [Condition: meibomian gland dysfunction]